Clinical trial inclusion criterion:
successful angioplasty (residual stenosis < 30%) on a significant stenosis (maximal systolic speed 3 times > from basal maximal systolic speed, stenosis > 70% on angiography) on the venous-prosthesis anastomosis or on the venous segment 5 cm after the anastomosis of a prosthetic haemodialysis vascular access (at least 1 month old)

Annotated entities:
- Procedure: "on the venous-prosthesis anastomosis angioplasty"
- Qualifier: "successful"
- Measurement: "residual stenosis"
- Value: "< 30%"
- Condition: "stenosis"
- Qualifier: "significant"
- Measurement: "maximal systolic speed"
- Value: "3 times > from basal"
- Measurement: "stenosis"
- Value: "> 70%"
- Procedure: "angiography"
- Procedure: "on the venous segment 5 cm after the anastomosis angioplasty"